Describe the Enhancing NeuroImaging Genetics through Meta-Analysis (ENIGMA) Consortium

The ENIGMA Consortium is a collaborative network of researchers working together on a range of large-scale studies that integrate data from 70 institutions worldwide. Organized into Working Groups that tackle questions in neuroscience, genetics, and medicine, EnIGMA studies have analyzed neuroimaging data from over 12,826 subjects. By meta-analyzing results from many sites, the consortium has detected factors that affect the brain that no individual site could detect on its own.